Clinical trial exclusion criterion:
High suicide risk, i.e. intent or plan to attempt suicide in near future;

Entity relations:
- Has_qualifier("suicide risk", "High")
- Has_mood("attempt suicide", "intent")
- Has_temporal("attempt suicide", "in near future")
- Subsumes("suicide risk", "attempt suicide")
- OR("intent", "plan to")